End stage liver disease, defined as acute or chronic liver disease and recent history of one of the following: ascites, encephalopathy, variceal bleeding, bilirubin equal or greater than 2.0 mg/dL, albumin equal or less than 3.5 g/ dL, prothrombin time greater or equal to 4 seconds, INR greater than or equal to 1.7 or prior liver transplant

The above is a clinical trial exclusion criterion. Annotated with entity spans:
[Condition: End stage liver disease], defined as [Condition: acute] or [Condition: chronic liver disease] and [Temporal: recent] history of one of the following: [Condition: ascites], [Condition: encephalopathy], [Condition: variceal bleeding], [Measurement: bilirubin] [Value: equal or greater than 2.0 mg/dL], [Measurement: albumin] [Value: equal or less than 3.5 g/ dL], [Measurement: prothrombin time] [Value: greater or equal to 4 seconds], [Measurement: INR] [Value: greater than or equal to 1.7] or [Temporal: prior] [Procedure: liver transplant]